Positive sputum culture, identification of bacterial type confirmed Mycobacterium tuberculosis. MGIT drug sensitivity test (DST) results are sensitive of the first-line drugs (isoniazid, streptomycin, rifampicin and ethambutol).

The above is a clinical trial inclusion criterion. Annotated with entity spans:
[Value: Positive] [Measurement: sputum culture], identification of [Qualifier: bacterial type] confirmed [Condition: Mycobacterium tuberculosis]. [Measurement: MGIT drug sensitivity test (DST)] results are [Value: sensitive of the first-line drugs (isoniazid, streptomycin, rifampicin and ethambutol)].